Clinical trial exclusion criterion:
MRI contraindications

Annotated entities:
- Procedure: "MRI"
- Condition: "contraindications"